感染下列何種病毒，有機會經多年後復發引起亞急性硬化全腦炎（subacute sclerosing panencephalitis)？
A. 麻疹病毒（Measles virus）
B. 腮腺炎病毒（Mumps virus）
C. 立百病毒（Nipah virus）
D. 亨得拉病毒（Hendra virus）

正確答案：A. 麻疹病毒（Measles virus）